假設分析某生物體的基因體實驗中發現，核酸中的 adenine 含量約為 20%，則此基因體的 guanine 含量為何？
A. 10%
B. 20%
C. 30%
D. 40%

正確答案：C. 30%